Clinical trial inclusion criterion:
Subjects age 21 and older

Annotated entities:
- Value: "21 and older"
- Person: "age"